Subject with a bleeding disorder

The above is a clinical trial exclusion criterion. Annotated with entity spans:
Subject with a [Condition: bleeding disorder]